7. Severe left ventricular hypertrophy or severe valvular disease

The above is a clinical trial exclusion criterion. Annotated with entity spans:
[Parsing_Error: 7.] [Qualifier: Severe] [Condition: left ventricular hypertrophy] or [Qualifier: severe] [Condition: valvular disease]